Patients were found to have arrhythmias or obtained QT wave elongation on electrocardiographic

The above is a clinical trial exclusion criterion. Annotated with entity spans:
Patients were found to have [Condition: arrhythmias] or obtained [Condition: QT wave elongation] on [Procedure: electrocardiographic]